Clinical trial inclusion criterion:
Expected survival time=3 months;

Entity relations:
- Has_value("Expected survival time=", "3 months")